Clinical trial exclusion criterion:
Follow-up less than 1 year

Annotated entities:
- Temporal: "less than 1 year"
- Measurement: "Follow-up"